Fasting blood glucose > 126 mg/dl

The above is a clinical trial inclusion criterion. Annotated with entity spans:
[Measurement: Fasting blood glucose] [Value: > 126 mg/dl]